Clinical trial exclusion criterion:
high blood pressure >180 systolic, 105, diastolic

Annotated entities:
- Measurement: "blood pressure systolic"
- Measurement: "blood pressure diastolic"
- Value: ">180"
- Value: "105"